Clinical trial inclusion criterion:
Patients scheduled for elective intervention to treat ischemic cardiovascular disease

Annotated entities:
- Post-eligibility: "Patients scheduled for elective intervention to treat ischemic cardiovascular disease"